Clinical trial exclusion criterion:
Hepatic dysfunction with increased bleeding risk

Entity relations:
- Has_qualifier("bleeding risk", "increased")
- AND("bleeding risk", "Hepatic dysfunction")